South Australian secondary school students in years 10, 11, and 12 in 2017

The above is a clinical trial inclusion criterion. Annotated with entity spans:
[Visit: South Australian] [Observation: secondary school students] in [Qualifier: years 10], 11, and 12 [Temporal: in 2017]